Clinical trial exclusion criterion:
hypersensitivity to perindopril or to other ACE inhibitors, amlodipine, atorvastatin, dihydropyridines or to or statins

Entity relations:
- Has_qualifier("ACE inhibitors", "other")
- AND("hypersensitivity", "perindopril")
- OR("perindopril", "amlodipine", "atorvastatin", "dihydropyridines", "statins", "ACE inhibitors")